Patient signing the consent form for at least the blood sample

The above is a clinical trial inclusion criterion. Annotated with entity spans:
[Post-eligibility: Patient signing the consent form for at least the blood sample]